¿Qué hecho es el que activa la vía intrínseca de la coagulación sanguínea?
1. El contacto de la sangre con las plaquetas activadas.
2. La liberación de calcio por la pared celular.
3. El contacto de la sangre con la tromboplastina tisular.
4. La liberación de colágeno por la pared celular.

Respuesta correcta: 4. La liberación de colágeno por la pared celular.